Which gene controls the expression of GATA-1 isoforms?

In this study, we report a transcriptional network in which PU.1 positively regulates GATA-1 expression in mast cell development.  This isoform contains an alternatively spliced first exon (IB) that is distinct from the first exon (IE) incorporated in the major erythroid mRNA transcript.